Clinical trial exclusion criterion:
Patient have contraindication to chemotherapy(eg.uncontrolled coronarism and heart failure; History of myocardial infarction within the past 6 months, Chronic obstructive pulmonary, uncontrolled epileptic attack and other disease that investigator consider it unsuitable for the chemotherapy)

Annotated entities:
- Condition: "contraindication"
- Procedure: "chemotherapy"
- Qualifier: "uncontrolled"
- Condition: "coronarism"
- Condition: "heart failure"
- Temporal: "History"
- Condition: "myocardial infarction"
- Temporal: "within the past 6 months"
- Condition: "Chronic obstructive pulmonary"
- Qualifier: "uncontrolled"
- Condition: "epileptic attack"
- Qualifier: "other"
- Condition: "disease"
- Condition: "unsuitable for the chemotherapy"
- Procedure: "chemotherapy"